Clinical trial inclusion criterion:
Meet Diagnostic and Statistical Manual version IV (DSM-IV) criteria for alcohol dependence or & DSM-V criteria for alcohol use disorder, severe.

Entity relations:
- Has_qualifier("alcohol use disorder", "severe")
- Has_qualifier("alcohol use disorder", "DSM-V criteria")
- Has_qualifier("alcohol dependence", "Diagnostic and Statistical Manual version IV (DSM-IV) criteria")